Clinical trial inclusion criterion:
patients who need suturing for laceration under procedural anesthesia using ketamine

Annotated entities:
- Procedure: "suturing"
- Condition: "laceration"
- Procedure: "procedural anesthesia"
- Drug: "ketamine"